The patient is available for 12 months of follow-up

The above is a clinical trial inclusion criterion. Annotated with entity spans:
[Post-eligibility: The patient is available for 12 months of follow-up]